Clinical trial exclusion criterion:
Patient with history of allergy in any kind anesthetic drug

Entity relations:
- Has_qualifier("anesthetic drug", "any kind")
- AND("allergy", "anesthetic drug")
- Has_temporal("allergy", "history")